What animal is thought to be the host for the Coronavirus causing MERS?

The Virus causing MERS is though to have originated in dromedary camels